Clinical trial inclusion criterion:
2. Active infection with EBV, CMV, and/or Adenovirus, unable to be successfully controlled with standard therapy.

Annotated entities:
- Parsing_Error: "2."
- Condition: "EBV"
- Condition: "CMV"
- Condition: "Adenovirus"
- Qualifier: "unable to be controlled"
- Procedure: "standard therapy"